Clinical trial inclusion criterion:
Diagnosis of Type 2 Diabetes from at least 3 years;

Annotated entities:
- Condition: "Type 2 Diabetes"
- Temporal: "at least 3 years"